下列何者不是目前所知癲癇手術的方法之一？
A. 顳葉切除（temporal lobe resection）
B. 胼胝體切開（corpus callosotomy）
C. 迷走神經刺激術（vagus nerve stimulation）
D. 迷走神經切斷術（vagus nerve transection）

正確答案：D. 迷走神經切斷術（vagus nerve transection）